Clinical trial inclusion criterion:
one licensed NNRTI or boosted protease inhibitor

Annotated entities:
- Multiplier: "one"
- Qualifier: "licensed"
- Drug: "NNRTI"
- Drug: "boosted protease inhibitor"